右耳進行迷路切除術（labyrinthectomy）可見出現何種眼振？
A. 水平眼振向右
B. 水平眼振向左
C. 垂直眼振向上
D. 垂直眼振向下

正確答案：B. 水平眼振向左